有一位 85 歲糖尿病病人，發生過腦血管意外（cerebral vascular accident, CVA），最近又有冠狀動脈疾病（coronary artery disease）而常常心絞痛（angina pectoris），他因尿毒症（uremia）需要長期透析，則那一種方法對他而言最安全？
A. 血液透析（Hemodialysis）
B. 連續可活動性腹膜透析（continuous ambulatory peritoneal dialysis）
C. 血液灌注術（hemoperfusion）
D. 連續動靜脈血液過濾法（continuous arterio-venous hemofiltration）

正確答案：B. 連續可活動性腹膜透析（continuous ambulatory peritoneal dialysis）